Clinical trial exclusion criterion:
History of acute or chronic pancreatitis

Annotated entities:
- Condition: "acute pancreatitis"
- Condition: "chronic pancreatitis"